9. Any of the following within the 12 months prior to study drug administration: myocardial infarction, severe/unstable angina, coronary/peripheral artery bypass graft, symptomatic congestive heart failure, cerebrovascular accident or transient ischemic attack, pulmonary embolism, deep vein thrombosis, or other thromboembolic event.

The above is a clinical trial exclusion criterion. Annotated with entity spans:
[Parsing_Error: 9.] Any of the following [Temporal: within the 12 months prior to study drug administration]: [Condition: myocardial infarction], [Condition: severe]/[Condition: unstable angina], [Condition: coronary]/[Condition: peripheral artery bypass graft], [Condition: symptomatic congestive heart failure], [Condition: cerebrovascular accident] or [Condition: transient ischemic attack], [Condition: pulmonary embolism], [Condition: deep vein thrombosis], or [Condition: other thromboembolic event].